Clinical trial exclusion criterion:
Ongoing acute kidney injury Stage 2/3

Annotated entities:
- Condition: "acute kidney injury"
- Measurement: "Stage"
- Value: "2/3"